Clinical trial inclusion criterion:
Patient is willing and able to give informed consent; and

Annotated entities:
- Informed_consent: "Patient is willing and able to give informed consent"